Clinical trial exclusion criterion:
Anaemia, defined as Hb <9g/dl

Annotated entities:
- Condition: "Anaemia"
- Measurement: "Hb"
- Value: "<9g/dl"